The patient is pregnant or breastfeeding

The above is a clinical trial exclusion criterion. Annotated with entity spans:
The patient is [Condition: pregnant] or [Observation: breastfeeding]